關於巴金森氏症治療藥物的敘述，下列何者錯誤？
A. deprenyl 為 monoamine oxidase B 的抑制劑，會增加腦中 dopamine 的濃度
B. bromocriptine 會直接活化 dopamine 受體
C. amantadine 會抑制 levodopa 的代謝
D. 在治療巴金森氏症時，levodopa 的效果較抗毒蕈素類藥物有效

正確答案：C. amantadine 會抑制 levodopa 的代謝